Which is the main reason for the increase in the incidence of cryptococcal disease?

It is an increasing cause of infection in immunosuppressed patients, most notably those with HIV infection. Currently, 4.0% patients with AIDS in the United Kingdom are known to have developed cryptococcosis. The incidence of infection with Cryptococcus neoformans has increased four-fold in the last decade.